Clinical trial inclusion criterion:
Blood pressure <140/90 mmHg at Screening and D-1. Measurement may be repeated within 24 hours, based on Investigator judgment.

Annotated entities:
- Measurement: "Blood pressure"
- Value: "<140/90 mmHg"
- Temporal: "at Screening and D-1"
- Reference_point: "Screening and D-1"
- Parsing_Error: "Measurement may be repeated within 24 hours, based on Investigator judgment."
- Subjective_judgement: "Measurement may be repeated within 24 hours, based on Investigator judgment."
- Non-query-able: "Measurement may be repeated within 24 hours, based on Investigator judgment."